Patient is currently benefiting from the treatment with pasireotide, as determined by the investigator

The above is a clinical trial inclusion criterion. Annotated with entity spans:
[Non-query-able: Patient is currently benefiting from the treatment with pasireotide, as determined by the investigator]